腱鞘囊腫是上肢最常見的良性腫瘤，它最常見的位置是在：
A. 手腕背側中間
B. 手腕腹橈側（volar radial site）
C. 掌骨彎曲皺摺（metacarpal flexion crease）
D. 末端指尖關節背側

正確答案：A. 手腕背側中間